Increased waist circumference (=102 cm in men; =88 cm in women)

The above is a clinical trial inclusion criterion. Annotated with entity spans:
[Value: Increased] [Measurement: waist circumference] ([Value: =102 cm] in [Person: men]; [Value: =88 cm] in [Person: women])